Clinical trial exclusion criterion:
Is dialysis-dependent or has (or is suspected of having) severe renal insufficiency (defined as estimated glomerular filtration rate (eGFR) <30 ml/min).

Annotated entities:
- Condition: "dialysis-dependent"
- Condition: "severe renal insufficiency"
- Measurement: "estimated glomerular filtration rate (eGFR)"
- Value: "<30 ml/min"